Presence of hepatic comorbidities

The above is a clinical trial exclusion criterion. Annotated with entity spans:
Presence of [Condition: hepatic comorbidities]